關於路易絲湖急性高山病（Lake Louise Acute Mountain Sickness）評估表內容的症狀及徵候，不包括下列何項？
A. 頭痛
B. 噁心、嘔吐
C. 腹瀉
D. 失眠

正確答案：C. 腹瀉